Clinical trial exclusion criterion:
G6PD deficiency (as determined by FST)

Annotated entities:
- Condition: "G6PD deficiency"